一位 55 歲女性因一年來有 4 次反覆性泌尿道感染，由其家庭醫師轉診。目前沒有症狀，沒有尿路結石病史，超音波顯示右腎結石及腎水腫，靜脈腎盂攝影顯示有一 4×3 公分結石在右腎盂並佔據中、下腎盞，尿液細菌培養為變形桿菌（Proteus mirabilis），此時下列何者是最適當的治療？
A. 輸尿管鏡碎石手術
B. 體外震波碎石術
C. 經皮穿腎取石手術
D. 腎臟切開取石手術

正確答案：C. 經皮穿腎取石手術